Para Florence Nightingale la enfermedad se correspondía con:
1. Un proceso reparador.
2. Una dolencia, vulnerabilidad.
3. Lo que puede valorarse físicamente y espiritualmente.
4. Defecto congénito o adquirido.

Respuesta correcta: 1. Un proceso reparador.